江先生是一位肺癌患者，手術及化療兩年後再度復發住院，江先生談到「我的病是不是不會好了？任何治療應該都沒有用，我不想再治療了」。你是江先生的醫師，下列何者屬於「同理心」的回應 ？
A. 「我們醫院設備齊全，我醫術高明」
B. 「你對病情很擔心，很害怕治不好，是不是？」
C. 「肺癌是很難治療，容易復發」
D. 「我們醫師會尊重你的決定」

正確答案：B. 「你對病情很擔心，很害怕治不好，是不是？」